Clinical trial inclusion criterion:
=18-40 year old women

Annotated entities:
- Person: "women"
- Person: "old"
- Value: "18-40 year"